Clinical trial inclusion criterion:
Aged 18-80

Entity relations:
- Has_value("Aged", "18-80")